En relación a los linfocitos TH2:
1. Estimulan las reacciones mediadas por mastocitos y esinófilos.
2. Producen IFN-gamma e IL-12.
3. Reclutan neutrófilos en las zonas de infección.
4. Su diferenciación es inducida por citocinas proinflamatorias.

Respuesta correcta: 1. Estimulan las reacciones mediadas por mastocitos y esinófilos.